22 歲女性，G2P1，妊娠 15 週，其血清、羊水與胎兒血清中「胎兒甲型蛋白」（alpha-fetoprotein, α-AFP）濃度高低排序，何者正確？
A. 母血清＞羊水＞胎兒血清
B. 胎兒血清＞羊水＞母血清
C. 母血清＞胎兒血清＞羊水
D. 羊水＞胎兒血清＞母血清

正確答案：B. 胎兒血清＞羊水＞母血清